Have a 10 yr probability of hip fracture >3% or major fracture >20% based on results of the FRAX tool

The above is a clinical trial exclusion criterion. Annotated with entity spans:
Have a [Measurement: 10 yr probability of hip fracture] [Value: >3%] or [Condition: major fracture] [Value: >20%] based on results of the FRAX tool